嚴重主動脈瓣膜閉鎖不全病患在身體檢查時會有許多徵象（signs），下列何者錯誤？
A. 指甲之甲床上可見脈搏之搏動（Quincke's pulse）
B. 股動脈用聽診器可聽見"pistol-shot＂聲音（Traube's sign）
C. 聽診時可聽到舒張期如風吹的心雜音，躺著比坐著容易聽見
D. 少數情況，主動脈瓣膜閉鎖不全的血液在心舒張期會影響到二尖瓣（僧帽瓣）前葉的打開，因此會產生類似二尖瓣狹窄的舒張期心雜音，稱為 Austin Flint murmur

正確答案：C. 聽診時可聽到舒張期如風吹的心雜音，躺著比坐著容易聽見